下列有關心音（heart sounds）的敍述，何者錯誤？
A. 第一心音為房室瓣關閉（二尖瓣及三尖瓣）
B. 第二心音為主動脈瓣及肺動脈瓣關閉
C. 通常在正常吸氣時第二心音會產生生理性分裂（physiological splitting of S2）
D. 第四心音的產生通常與左心的血流量增加有關，如合併二尖瓣閉鎖不全

正確答案：D. 第四心音的產生通常與左心的血流量增加有關，如合併二尖瓣閉鎖不全